以病理組織來分，葡萄胎可區分為完全性與部分性葡萄胎（complete/partial mole）兩大類。下列何者為部分性葡萄胎（partial mole）最可能的染色體型態（karyotype）？
A. 45, XO
B. 46, XY
C. 46, XX
D. 69, XXY

正確答案：D. 69, XXY